Hombre de 78 años de edad con artritis reumatoide (AR) de larga evolución mal controlada. Antecedentes de 2 ingresos por insuficiencia cardiaca y fibrilación auricular en los últimos 6 meses. En tratamiento actual con infliximab, prednisona, furosemida, enalapril, carvedilol y acenocumarol. Ingresa nuevamente por     clínica   de    insuficiencia    cardiaca biventricular. En el ECG se objetiva fibrilación auricular a 102 lpm y bloqueo de rama izquierda avanzado. Un ecocardiograma muestra dilatación biauricular, engrosamiento de la pared del ventrículo izquierdo con fracción de eyección del 45% y patrón restrictivo. En la analítica destaca: Hb 10 gr/dL, creatinina 2,1 mg/dL (FG 20 mL/min), PCR 124 mg/L , factor reumatoide 240 U/L, BNP 980 ng/L, proteinuria 4,8 g/24h. ¿Cuál es el diagnóstico más probable?
1. Síndrome cardio-renal tipo 2.
2. Amiloidosis AA.
3. Miocarditis de células gigantes.
4. Toxicidad por infliximab.
5. Glomerulonefritis membranosa asociada a AR.

Respuesta correcta: 2. Amiloidosis AA.